6 歲男童因反覆性血尿至門診求治，每次感冒後兩三天，血尿之情況更為嚴重，下列何種診斷最不可能？
A. IgA nephropathy
B. Thin basement membrane disease
C. Alport syndrome
D. Focal sclerosing glomerulosclerosis

正確答案：D. Focal sclerosing glomerulosclerosis